Aged 1 to < 6 years

The above is a clinical trial inclusion criterion. Annotated with entity spans:
[Line: Aged 1 to < 6 years]